Clinical trial exclusion criterion:
Pregnant female, as determined for women less than 60 years old by a positive urine pregnancy test during the screening window.

Annotated entities:
- Condition: "Pregnant"
- Person: "female"
- Person: "women"
- Value: "less than 60 years"
- Person: "old"
- Value: "positive"
- Measurement: "urine pregnancy test"
- Temporal: "during the screening window"